一位34歲類風濕關節炎患者兩手PIP及MCP joints有腫脹，腕關節有腫脹及活動受限，兩側肘關節有腫脹及變形。ESR：83 mm/1h，CRP：5.36 mg/dL（normal < 0.8 mg/dL），RF：635 IU/mL（normal<10 IU/mL），經以methotrexate 15 mg/week+salfasalazine 500 mg QID及prednisolone 10 mg QD治療約半年無顯	效果，下一步應該選擇何種治療藥物最為恰當？
A. anti-TNF-α
B. IL-1 receptor antagonist
C. prednisolone 1000 mg/day pulse therapy for 3 days
D. anti-pyrimidine agent

正確答案：A. anti-TNF-α